Clinical trial inclusion criterion:
HIV/HCV co-infected subjects (n=12) must also have a HIV RNA measurement <50 copies/mL at the pre-treatment visit.

Entity relations:
- AND("co-infected", "HCV")
- AND("co-infected", "HIV")
- Has_value("HIV RNA measurement", "<50 copies/mL")
- Has_temporal("HIV RNA measurement", "at the pre-treatment visit")
- AND("co-infected", "HIV RNA measurement")